Hombre de 88 años autónomo para todas las actividades de la vida diaria y con antecedentes de HTA bien controlada, fibrilación auricular antiagregada y un adenocarcinoma de próstata a los 78 años actualmente libre de enfermedad. Es traído a urgencias por clínica de afasia y hemiparesia derecha de inicio brusco, 45 minutos antes. ¿Cuál es la actitud más correcta?
1. Realizar TC craneal y si no hay lesiones hemorrágicas ni otras contraindicaciones en la analítica, iniciaría trombolisis endovenosa de forma inmediata.
2. Realizar TC craneal urgente y si no hay sangrado iniciar anticoagulación.
3. Realizar TC craneal e ingreso en centro de rehabilitación, ya que su actitud no diferirá independientemente de si la etiología es isquémica o hemorrágica.
4. No hace falta TC craneal, aunque retiraría la antiagregación.

Respuesta correcta: 1. Realizar TC craneal y si no hay lesiones hemorrágicas ni otras contraindicaciones en la analítica, iniciaría trombolisis endovenosa de forma inmediata.